Clinical trial exclusion criterion:
Colonoscopy scheduled to be undertaken peroperatively

Annotated entities:
- Procedure: "Colonoscopy"
- Temporal: "peroperatively"
- Mood: "scheduled"
- Procedure: "undertaken"